Understand and sign consent form

The above is a clinical trial inclusion criterion. Annotated with entity spans:
[Post-eligibility: Understand and sign consent form]